下列何者不是口咽部原發	狀上皮癌的危險因子？
A. 吸菸
B. 喝酒
C. Epstein-Barr病毒感染
D. 人類乳突病毒感染（HPV）

正確答案：C. Epstein-Barr病毒感染